Clinical trial exclusion criterion:
Subjects with elevated uric acid levels greater than 10 mg/dL or gout

Annotated entities:
- Measurement: "uric acid levels"
- Value: "elevated"
- Value: "greater than 10 mg/dL"
- Condition: "gout"